Patients who are recipients of multiple solid organ or islet cell tissue transplants, or have previously received an organ or tissue transplant. Patients who have a combined liver-kidney transplant.

The above is a clinical trial exclusion criterion. Annotated with entity spans:
Patients who are recipients of [Multiplier: multiple] [Procedure: solid organ] or [Procedure: islet cell tissue transplants], or have [Temporal: previously] received an [Procedure: organ] or [Procedure: tissue transplant]. Patients who have a [Procedure: combined liver-kidney transplant].